Clinical trial exclusion criterion:
medical thoracoscopy cannot be performed within 48 hours;

Annotated entities:
- Procedure: "medical thoracoscopy"
- Mood: "cannot be performed"
- Temporal: "within 48 hours"
- Negation: "cannot"